Clinical trial exclusion criterion:
irritable bowel, unexplained intermittent vomiting, severe abdominal pain, chronic diarrhea or constipation

Entity relations:
- Has_qualifier("diarrhea", "chronic")
- Has_qualifier("abdominal pain", "severe")
- Has_qualifier("vomiting", "intermittent")
- OR("diarrhea", "constipation")
- OR("irritable bowel", "vomiting", "abdominal pain", "diarrhea")